¿Cuál de las siguientes respuestas es verdadera en relación con la Artritis Reumatoide?:
1. Afectación típicamente bilateral.
2. La afectación de la columna vertebral se limita a las vértebras lumbares.
3. La rodilla es una de las articulaciones que con menor frecuencia se afecta.
4. Los nódulos reumatoideos son siempre móviles.

Respuesta correcta: 1. Afectación típicamente bilateral.